Clinical trial inclusion criterion:
Scheduled for elective posterior lumbar spinal fusion surgery between 1 and 3 levels

Annotated entities:
- Procedure: "posterior lumbar spinal fusion surgery"
- Qualifier: "elective"
- Mood: "Scheduled for"
- Qualifier: "between 1 and 3 levels"